infectious, suppurative and allergic dermatosis

The above is a clinical trial exclusion criterion. Annotated with entity spans:
[Condition: infectious], [Condition: suppurative] and [Condition: allergic dermatosis]